prior allergic reaction to interferon products, congestive heart failure, elevated liver enzymes

The above is a clinical trial exclusion criterion. Annotated with entity spans:
[Temporal: prior] [Condition: allergic reaction] to [Drug: interferon products], [Condition: congestive heart failure], [Condition: elevated liver enzymes]